Males and females who are at least 18 years of age at time of enrollment.

The above is a clinical trial inclusion criterion. Annotated with entity spans:
[Person: Males] and [Person: females] who are [Value: at least 18 years] of [Person: age] [Temporal: at time of enrollment].